Clinical trial inclusion criterion:
Negative HIV serology during screening period.

Annotated entities:
- Measurement: "HIV serology"
- Value: "Negative"
- Temporal: "during screening period"
- Reference_point: "screening period"